List 3 apoE mimetics.

COG133, COG112 and Ac-hE18A-NH(2) are apoE mimetics.